下列有關腦性麻痺的敘述，何者有誤？
A. 屬運動功能障礙
B. 為進行性神經病變
C. 發生於大腦未發展成熟時期
D. 可能合併智障、癲癇等問題

正確答案：B. 為進行性神經病變